關於脂肪組織之脂肪代謝，下列敘述何者錯誤？
A. 脂肪組織脂肪分解，釋放出來的脂肪酸，可供給其他組織產生能量
B. 脂肪組織脂肪分解，分解出來的脂肪酸，釋放至血液與血清白蛋白（serum albumin）結合
C. 脂肪組織脂肪分解，釋放出來的脂肪酸可送到肝臟內再合成三酸甘油酯，所以肥胖病患易合併脂肪肝
D. 空腹時，釋放出來的脂肪酸送到肝臟內合成三酸甘油酯，包裝成乳糜微粒（chylomicron）分泌至血液中

正確答案：D. 空腹時，釋放出來的脂肪酸送到肝臟內合成三酸甘油酯，包裝成乳糜微粒（chylomicron）分泌至血液中